Clinical trial exclusion criterion:
stroke within the preceding 12 months.

Entity relations:
- Has_temporal("stroke", "within the preceding 12 months")